Patients with Moderate to Advanced Chronic periodontitis

The above is a clinical trial inclusion criterion. Annotated with entity spans:
Patients with [Qualifier: Moderate] to [Qualifier: Advanced] [Condition: Chronic periodontitis]